Active cell phone with text messaging capability

The above is a clinical trial inclusion criterion. Annotated with entity spans:
[Observation: Active cell phone with text messaging capability]